Singleton fetus

The above is a clinical trial inclusion criterion. Annotated with entity spans:
[Condition: Singleton fetus]